Clinical trial inclusion criterion:
2. Healthy subjects aged between 18 years and 45 years inclusive

Annotated entities:
- Parsing_Error: "2."
- Person: "aged"
- Value: "between 18 years and 45 years inclusive"
- Condition: "Healthy"